Clinical trial inclusion criterion:
Receiving a prescription of Adalimumab 40 mg subcutaneous every two weeks.

Entity relations:
- Has_multiplier("Adalimumab", "40 mg every two weeks")
- Has_qualifier("Adalimumab", "subcutaneous")